Clinical trial inclusion criterion:
No signs of poor peripheral perfusion

Annotated entities:
- Negation: "No"
- Mood: "signs of"
- Condition: "poor peripheral perfusion"